Clinical trial exclusion criterion:
Subjects who have any other condition which the investigator judges would make patients unsuitable for study participation

Entity relations:
- Has_qualifier("any other condition", "the investigator judges would make patients unsuitable for study participation")